對於食道的主要血液供應，下列何者錯誤？
A. 上甲狀腺動脈
B. 下甲狀腺動脈
C. 胸主動脈
D. 左胃動脈

正確答案：A. 上甲狀腺動脈